Clinical trial exclusion criterion:
17. Severe gastrointestinal disease.

Entity relations:
- Has_qualifier("gastrointestinal disease", "Severe")